Clinical trial inclusion criterion:
Person is a unilateral transfemoral or knee-disarticulation amputee with stabilized residual limb.

Annotated entities:
- Non-query-able: "Person is a unilateral transfemoral or knee-disarticulation amputee with stabilized residual limb"